Clinical trial exclusion criterion:
co-morbidity: severe kidney- and/or liver disease or other gastrointestinal diseases

Entity relations:
- Has_qualifier("kidney disease", "severe")
- OR("kidney disease", "liver disease", "gastrointestinal diseases")